Clinical trial inclusion criterion:
HIV positive with documentation present in source document.

Annotated entities:
- Measurement: "HIV"
- Value: "positive"
- Condition: "HIV positive"